Central + mixed apneas > 25% of the total apnea-hypopnea index (AHI)

The above is a clinical trial exclusion criterion. Annotated with entity spans:
[Condition: Central] + [Condition: mixed apneas] [Value: > 25%] of the [Measurement: total apnea-hypopnea index] ([Measurement: AHI])